Clinical trial exclusion criterion:
Diagnosis or h/o PTSD, depression, substance use, mental health problems, sleep disorders, HPA disruption and/or TBI

Entity relations:
- OR("PTSD", "HPA disruption", "sleep disorders", "mental health problems", "substance use", "depression", "TBI")